Clinical trial inclusion criterion:
Willing and capable to have stimulation hardware permanently implanted, and to use the patient remote to activate the stimulation

Annotated entities:
- Post-eligibility: "Willing and capable to have stimulation hardware permanently implanted, and to use the patient remote to activate the stimulation"